Clinical trial inclusion criterion:
no allergy known to these drugs

Annotated entities:
- Condition: "allergy"
- Drug: "these drugs"
- Negation: "no"